有關 colon diverticulum 的敘述，何者為非？
A. 它不會發生在 lateral mesenteric taeniae 與 mesenteric taeniae 之間
B. 它不會發生在兩個 lateral mesenteric taeniae 之間的 antimesenteric side
C. 通常只有 mucosa 的部分 herniation，所以是一種 pseudodiverticulum
D. 通常發生在 perforating vessel 穿透 colon wall 之處

正確答案：A. 它不會發生在 lateral mesenteric taeniae 與 mesenteric taeniae 之間